10. Women of child-bearing potential must have a negative pregnancy test

The above is a clinical trial inclusion criterion. Annotated with entity spans:
[Parsing_Error: 10.] [Person: Women] of [Condition: child-bearing potential] must have a [Value: negative] [Measurement: pregnancy test]